以下對 staphylococcal scalded skin syndrome（SSSS）及 toxic epidermal necrolysis（TEN）的敘述，何者正確？
A. SSSS 好發於老年人
B. TEN 是由 Staphylococcus aureus 釋放的 exotoxin 所引起
C. 兩者的皮膚被磨擦時都會有 Nikolsky's sign
D. SSSS 會造成整個表皮層的壞死

正確答案：C. 兩者的皮膚被磨擦時都會有 Nikolsky's sign